Patients with allergies to narcotics or local anesthetic; or anticoagulant use (e.g. warfarin, dabigatran, rivaroxaban).

The above is a clinical trial exclusion criterion. Annotated with entity spans:
Patients with [Condition: allergies] to [Drug: narcotics] or [Drug: local anesthetic]; or [Drug: anticoagulant] use (e.g. [Drug: warfarin], [Drug: dabigatran], [Drug: rivaroxaban]).